LA size < 65

The above is a clinical trial inclusion criterion. Annotated with entity spans:
[Measurement: LA size] [Value: < 65]